Clinical trial exclusion criterion:
Other contraindications in package insert.

Annotated entities:
- Observation: "contraindications in package insert"